關於肺外型游離肺（extra-pulmonary sequestration）的敘述，下列何者錯誤？
A. 其血液供應來自體循環
B. 與支氣管有相通及氣體交流
C. 大部分發生在肺下葉
D. 較常見於左肺

正確答案：B. 與支氣管有相通及氣體交流